Clinical trial inclusion criterion:
Histologically confirmed diagnosis of unresectable, recurrent, and/or metastatic high grade soft-tissue or bone sarcoma of one of the following subtypes: soft tissue sarcomas (leiomyosarcoma, poorly differentiated/de-differentiated liposarcoma, high grade pleomorphic undifferentiated sarcoma/MFH and synovial sarcoma), and bone sarcomas (Ewing sarcoma, osteosarcoma, and chondrosarcoma [de-differentiated or mesenchymal]).

Entity relations:
- Has_value("Histologically", "confirmed")
- Has_qualifier("soft-tissue sarcoma", "unresectable")
- Has_qualifier("liposarcoma", "poorly differentiated")
- Has_qualifier("sarcoma", "undifferentiated")
- Has_qualifier("chondrosarcoma", "de-differentiated")
- Subsumes("bone sarcomas", "Ewing sarcoma")
- Subsumes("soft tissue sarcomas", "leiomyosarcoma")
- Subsumes("soft-tissue sarcoma", "soft tissue sarcomas")
- AND("soft-tissue sarcoma", "Histologically")
- AND("undifferentiated", "pleomorphic")
- AND("pleomorphic", "high grade")
- Subsumes("soft tissue sarcomas", "liposarcoma")
- OR("unresectable", "metastatic", "recurrent", "high grade")
- OR("soft-tissue sarcoma", "bone sarcoma")
- OR("poorly differentiated", "de-differentiated")
- OR("sarcoma", "MFH")
- OR("de-differentiated", "mesenchymal")
- OR("Ewing sarcoma", "osteosarcoma", "chondrosarcoma")
- OR("soft tissue sarcomas", "bone sarcomas")